Dasatinib and Blinatumomab are used for treatment of which disease?

Dasatinib and Blinatumomab produces molecular responses in patients with Philadelphia chromosome-positive acute lymphoblastic leukemia.